El Test de dibujo de la familia es una técnica proyectiva de tipo:
1. Temático.
2. Expresivo.
3. Asociativo.
4. Constructivo.
5. Perceptivo.

Respuesta correcta: 2. Expresivo.